Clinical trial inclusion criterion:
=18-40 year old women

Entity relations:
- Has_value("old", "18-40 year")